Clinical trial exclusion criterion:
Any chronic medical illness or condition that contraindicates a surgical procedure under general anesthesia, as judged by the clinical study Investigator

Entity relations:
- AND("contraindicates", "surgical procedure")
- AND("surgical procedure", "general anesthesia")